Clinical trial exclusion criterion:
Co-infected with HCV, HIV or other viral hepatitis,

Annotated entities:
- Condition: "HCV"
- Temporal: "Co-infected"
- Condition: "HIV"
- Qualifier: "other"
- Condition: "viral hepatitis"